Clinical trial inclusion criterion:
Level I or level II on the American Society of Anesthesiologists (ASA) physical status classification system (as determined by the anesthesiologist)

Entity relations:
- Has_value("American Society of Anesthesiologists (ASA) physical status", "Level I or level II")